下列那一個選項所列的兩種菌屬，最可能是造成 Tinea unguium（甲癬、灰指甲）感染之皮膚真菌性 病原（Dermatophytes）？
A. Sporothrix and Microsporum
B. Epidermophyton and Microsporum
C. Trichophyton and Epidermophyton
D. Trichophyton and Sporothrix

正確答案：C. Trichophyton and Epidermophyton